下列何者為喉癌（laryngeal cancer）最常見之症狀？
A. 吞嚥疼痛（odynophagia）
B. 聲音沙啞（hoarseness）
C. 喘鳴（stridor）
D. 呼吸困難（dyspnea）

正確答案：B. 聲音沙啞（hoarseness）